Clinical trial exclusion criterion:
Infection at the injection site

Entity relations:
- Has_qualifier("Infection", "injection site")